關於手術中，使用經食道超音波（Transesophageal echocardiography, TEE）作監測之敘述，下列何者錯誤？
A. TEE 可以用來評估左心室的功能，包括射出分率（Ejection fraction），收縮功能是否異常等
B. TEE 作為監測手術中是否產生氣體栓塞（Air embolism）是相當敏感的
C. 手術中發生心肌梗塞（Myocardial infarction），並不易藉由 TEE 監測到
D. TEE 也可以用來評估心臟瓣膜的功能和瓣膜形態的異常

正確答案：C. 手術中發生心肌梗塞（Myocardial infarction），並不易藉由 TEE 監測到